Clinical trial exclusion criterion:
Participant has a history of spontaneous, prolonged or severe bleeding of unclear origin

Entity relations:
- Has_qualifier("bleeding", "unclear origin")
- Has_qualifier("bleeding", "spontaneous")
- Has_temporal("bleeding", "history")
- OR("spontaneous", "prolonged", "severe")